口咽膜（oropharyngeal membrane）約於胚胎發育至第幾週時會破裂？
A. 2
B. 3
C. 4
D. 5

正確答案：C. 4